Which tool has been developed for microRNA-target enrichment and network-based analysis?

MIENTURNET is a web tool for microRNA-target enrichment and network-based analysis. MIENTURNET offers the possibility to consistently perform both statistical and network-based analyses.